Clinical trial inclusion criterion:
Agree to not seek additional treatment, apart from Alcoholics Anonymous

Annotated entities:
- Non-representable: "Agree to not seek additional treatment, apart from Alcoholics Anonymous"